History of other chronic neurological illnesses that might mimic MS with chronic or intermittent symptoms (i.e. ALS, myasthenia gravis, chronic neuropathy, etc.)

The above is a clinical trial exclusion criterion. Annotated with entity spans:
[Temporal: History of] other [Condition: chronic neurological illnesses] that might [Qualifier: mimic MS] with chronic or intermittent symptoms (i.e. [Condition: ALS], [Condition: myasthenia gravis], [Condition: chronic neuropathy], etc.)